Patient or legally authorized representative provides written informed consent to enroll in this study

The above is a clinical trial inclusion criterion. Annotated with entity spans:
[Informed_consent: Patient or legally authorized representative provides written informed consent to enroll in this study]